Clinical trial exclusion criterion:
History of chronic pain

Annotated entities:
- Condition: "chronic pain"
- Temporal: "History"